Females of childbearing potential must agree to use an efficacious hormonal or barrier method of birth control during the study. Abstinence is acceptable.

The above is a clinical trial inclusion criterion. Annotated with entity spans:
[Person: Females] of [Observation: childbearing potential] must [Mood: agree to use] an [Qualifier: efficacious] [Qualifier: hormonal] or [Qualifier: barrier method] of [Procedure: birth control] [Temporal: during the study]. [Observation: Abstinence] is acceptable.